3. Agree to daily application of gel and monitoring as per Daily Monitored Adherence (DMA) method

The above is a clinical trial inclusion criterion. Annotated with entity spans:
3. [Post-eligibility: Agree to daily application of gel and monitoring as per Daily Monitored Adherence (DMA) method]